脾臟破裂進行緊急手術，於脾動脈（splenic artery）發源處結紮該動脈以利止血，術後，下列何者的血流不受影響？
A. 背胰動脈（dorsal pancreatic artery）
B. 短胃動脈（short gastric artery）
C. 左胃動脈（left gastric artery）
D. 左胃網膜動脈（left gastroomental artery）

正確答案：C. 左胃動脈（left gastric artery）